La somatomedina IGF-1 causa:
1. Secreción de GHRH.
2. Catabolismo proteico.
3. Hiperglucemia.
4. Activación de osteoblastos
5. Secreción de GH.

Respuesta correcta: 4. Activación de osteoblastos